Clinical trial exclusion criterion:
Impairment of gastrointestinal (GI) function or GI disease that may significantly alter the absorption of dovitinib

Annotated entities:
- Condition: "Impairment of gastrointestinal (GI) function"
- Condition: "GI disease"
- Qualifier: "may significantly alter the absorption of dovitinib"
- Undefined_semantics: "may significantly alter the absorption of dovitinib"